Clinical trial inclusion criterion:
2. One cycle of intermittent therapy up to a maximum exposure of 10 months.

Annotated entities:
- Multiplier: "One cycle"
- Procedure: "intermittent therapy"
- Measurement: "maximum exposure"
- Value: "10 months"